Willing to participate in research

The above is a clinical trial inclusion criterion. Annotated with entity spans:
[Mood: Willing to] [Observation: participate in research]